Es ya muy común el empleo de columnas monolíticas y lechos continuos en cromatografía de líquidos. Con este fin:
1. Se emplean membranas microporosas de forma que la interacción entre un soluto y la matriz tiene lugar en la parte final del poro.
2. Se introduce un medio de separación con un mayor grado de continuidad que la fase estacionaria partículada de forma que la fase móvil es forzada a atravesar los grandes poros del medio, mejorando el transporte de masa.
3. Se emplean partículas monodispersas como fase estacionaria con el fin de mejorar la transferencia de masa.
4. Se usan geles orgánicos flexibles a partir de polímeros microporosos con el fin de disminuir las velocidades de flujo.
5. Se usan columnas rellenas de pequeñas partículas de sílice polimerizada.

Respuesta correcta: 2. Se introduce un medio de separación con un mayor grado de continuidad que la fase estacionaria partículada de forma que la fase móvil es forzada a atravesar los grandes poros del medio, mejorando el transporte de masa.